下列有關急性前骨髓細胞白血病（acute promyelocytic leukemia）的敘述，何者錯誤？
A. 容易發生瀰漫性血管內凝血（DIC）
B. 帶有染色體異常t（5;7）
C. 有異常之PML/RARα融合基因
D. 以反轉式維甲酸tretinoin治療，可以達到完全緩解

正確答案：B. 帶有染色體異常t（5;7）